4. Incapable of completing bowel preparation，such as dysphagia, allergy to purgatives, or impaired mental status, etc.

The above is a clinical trial exclusion criterion. Annotated with entity spans:
[Parsing_Error: 4.] [Condition: Incapable of completing bowel preparation]，such as [Condition: dysphagia], [Condition: allergy] to [Drug: purgatives], or [Condition: impaired mental status], etc.